Clinical trial inclusion criterion:
Pregnancy

Annotated entities:
- Condition: "Pregnancy"